下列有關不停跳冠狀動脈繞道手術（off-pump coronary artery bypass grafting）之敘述，何者錯誤？
A. 可以降低手術後心房震顫
B. 可以減少術中及術後的輸血
C. 血液動力學不穩定之病人應優先考慮不停跳冠狀動脈繞道手術
D. 合併有腎功能不良及肺氣腫的病人應優先考慮不停跳冠狀動脈繞道手術

正確答案：C. 血液動力學不穩定之病人應優先考慮不停跳冠狀動脈繞道手術